60 歲男性於腹主動脈剝離後 3 日，發現雙下肢無力與麻木、失禁，神經學檢查顯示下肢的感覺功能異常，但下列何感覺功能仍可能是正常？
A. 振動感（vibration）
B. 觸感（touch）
C. 溫度感（temperature）
D. 針刺感（pin-prick）

正確答案：A. 振動感（vibration）